Clinical trial inclusion criterion:
Pre-operative hemoglobin >8 g/dl

Annotated entities:
- Temporal: "Pre-operative"
- Reference_point: "operative"
- Procedure: "operative"
- Measurement: "hemoglobin"
- Value: ">8 g/dl"